有關大腸生理功能的說明，下列何者錯誤？
A. 人體所放出的flatus，以吸入之大氣空氣為主
B. 關於大腸癌好發在遠端大腸，有一說法是因為遠端大腸較缺乏醣類，所以遠端大腸的細菌主要行蛋白質putrefactive process，容易堆積毒素所造成的
C. short-chain fatty acids（包含 acetate, propionate和 butyrate）對於大腸細胞是很重要的物質，可以幫助正常細胞生長	 和抑制癌細胞生長的功能
D. 食用纖維（dietary fiber）中，water-soluble的可以被腸道細菌分解產生short-chain fatty acid，water-insoluble可以利用來治療便秘

正確答案：A. 人體所放出的flatus，以吸入之大氣空氣為主